Clinical trial inclusion criterion:
planned elective cholecystectomy

Entity relations:
- Has_qualifier("cholecystectomy", "elective")
- Has_mood("cholecystectomy", "planned")